Clinical trial exclusion criterion:
Allergy to anesthetic agents

Entity relations:
- AND("Allergy", "anesthetic agents")